medication: antidepressants or H1-receptor antagonists

The above is a clinical trial exclusion criterion. Annotated with entity spans:
medication: [Drug: antidepressants] or [Drug: H1-receptor antagonists]